¿Cuál de los siguientes contextos clínicos debe hacernos sospechar un proceso paraneoplásico y, por tanto, nos obliga a realizar un despistaje de neoplasia maligna?
1. Niño de 13 años con púrpura palpable en miembros inferiores y nalgas, artralgias y dolor abdominal.
2. Hombre de 36 años con maculo-pápulas con ampolla central "en diana" en dorso manos, palmas y antebrazos con erosiones y ulceraciones en mucosa oral.
3. Mujer de 44 años con eritema en ambas regiones     malares      y     dorso    nasal, fotosensibilidad y eritema palmar en yemas de dedos de las manos.
4. Hombre de 27 años con máculas despigmentadas bien delimitadas de forma simétrica en región peribucal, periorbitaria y en la parte distal de dedos de manos y pies junto con alopecia en placa en región occipital con tallos pilosos cortos y rotos sin descamación ni eritema.
5. Mujer de 68 años con debilidad muscular progresiva en raíz de miembros, edema y exantema periorbitario violáceo y pápulas queratósicas en cara dorsal de las articulaciones interfalángicas.

Respuesta correcta: 5. Mujer de 68 años con debilidad muscular progresiva en raíz de miembros, edema y exantema periorbitario violáceo y pápulas queratósicas en cara dorsal de las articulaciones interfalángicas.